clinical evidence of current malignancy with exception of basal cell or squamous cell carcinoma of the skin, and cervical intraepithelial neoplasia (5 years prior to randomization)

The above is a clinical trial exclusion criterion. Annotated with entity spans:
clinical evidence of current [Condition: malignancy] with [Negation: exception] of [Condition: basal cell] or [Condition: squamous cell carcinoma of the skin], and [Condition: cervical intraepithelial neoplasia] ([Temporal: 5 years prior to randomization])